Patients with contraindications listed in the currently valid SP

The above is a clinical trial exclusion criterion. Annotated with entity spans:
Patients with [Condition: contraindications] [Qualifier: listed in the currently valid SP]